Renal function within normal range for age

The above is a clinical trial inclusion criterion. Annotated with entity spans:
[Measurement: Renal function] [Value: within normal range for age]